Uncontrolled ascites or hepatic encephalopathy

The above is a clinical trial exclusion criterion. Annotated with entity spans:
[Qualifier: Uncontrolled] [Condition: ascites] or [Condition: hepatic encephalopathy]